age > 80 years;

The above is a clinical trial exclusion criterion. Annotated with entity spans:
[Person: age] [Value: > 80 years];